細菌的DNA錯配修復（mismatch repair）主要是利用下列何種DNA的修飾反應，以判斷那一股為模板股 （template strand）？
A. 乙醯化（acetylation）
B. 磷酸化（phosphorylation）
C. 甲基化（methylation）
D. 醣化（glycation）

正確答案：C. 甲基化（methylation）